Clinical trial inclusion criterion:
A female subject is eligible to participate if she is of: Non-childbearing potential defined as pre-menopausal females with a documented tubal ligation or hysterectomy for this definition, "documented" refers to the outcome of the investigator's/designee's review of the subject's medical history for study eligibility, as obtained via a verbal interview with the subject or from the subject's medical records; or postmenopausal defined as 12 months of spontaneous amenorrhea [in questionable cases a blood sample with simultaneous follicle stimulating hormone (FSH) > 40 milli-international units per milliliter (MlU/mL) and estradiol < 40 picograms per mililiter (pg/mL) [<147 picomole per liter] is confirmatory]. Females on hormone replacement therapy (HRT) and whose menopausal status is in doubt will be required to use one of the contraception methods if they wish to continue their HRT during the study. Otherwise, they must discontinue HRT to allow confirmation of post-menopausal status prior to study enrollment. For most forms of HRT, at least 2-4 weeks will elapse between the cessation of therapy and the blood draw; this interval depends on the type and dosage of HRT. Following confirmation of their post-menopausal status, they can resume use of HRT during the study without use of a contraceptive method; Child-bearing potential with negative pregnancy test as determined by serum human chorionic gonadotrophin (hCG) test at screening or prior to dosing AND; Agrees to use one of the contraception methods listed in protocol for an appropriate period of time (as determined by the product label or investigator) prior to the start of dosing to sufficiently minimize the risk of pregnancy at that point. Female subjects must agree to use contraception until the follow-up contact visit; OR has only same-sex partners, when this is her preferred and usual lifestyle.

Entity relations:
- Has_negation("childbearing potential", "Non")
- Has_temporal("spontaneous amenorrhea", "12 months")
- Has_value("follicle stimulating hormone (FSH)", "> 40 milli-international units per milliliter (MlU/mL)")
- Subsumes("< 40 picograms per mililiter (pg/mL)", "<147 picomole per liter")
- Has_value("estradiol", "< 40 picograms per mililiter (pg/mL)")
- Subsumes("spontaneous amenorrhea", "follicle stimulating hormone (FSH)")
- Subsumes("postmenopausal", "spontaneous amenorrhea")
- Subsumes("childbearing potential", "postmenopausal")
- Has_value("menopausal status", "in doubt")
- Subsumes("spontaneous amenorrhea", "estradiol")
- OR("tubal ligation", "hysterectomy")
- OR("pre-menopausal", "spontaneous amenorrhea")
- OR("females", "spontaneous amenorrhea")
- OR("tubal ligation", "spontaneous amenorrhea")